下列何者不支配陰囊（scrotum）？
A. 閉孔神經（obturator nerve）
B. 股後側皮神經（posterior femoral cutaneous nerve）
C. 陰部神經（pudendal nerve）
D. 髂腹股溝神經（ilioinguinal nerve）

正確答案：A. 閉孔神經（obturator nerve）